Medical history, if applicable (natural menopause at least 12 months prior to first study drug administration; or surgical menopause by bilateral ovariectomy at least 3 months prior to first study drug administration), in addition: in women < 65 years old, follicle stimulating hormone (FSH) > 40 IU/L

The above is a clinical trial inclusion criterion. Annotated with entity spans:
Medical history, if applicable ([Condition: natural menopause] [Temporal: at least 12 months prior to first study drug administration]; or [Condition: surgical menopause] by [Procedure: bilateral ovariectomy] [Temporal: at least 3 months prior to first study drug administration]), in addition: in [Person: women] [Value: < 65 years] old, [Measurement: follicle stimulating hormone (FSH)] [Value: > 40 IU/L]